Treatments or procedures indicated on the tear film dysfunction treatment, as punctal silicone plugs.

The above is a clinical trial exclusion criterion. Annotated with entity spans:
[Procedure: Treatments] or [Procedure: procedures] indicated on the [Procedure: tear film dysfunction treatment], as [Device: punctal silicone plugs].